下列何者與其胎盤剝離關聯性較高？
A. 年紀輕
B. 長期飲酒
C. 多胞胎懷孕
D. 羊水過少

正確答案：C. 多胞胎懷孕